Clinical trial exclusion criterion:
4. Auto-immune hepatitis

Annotated entities:
- Parsing_Error: "4."
- Condition: "Auto-immune hepatitis"